Al enfriar rápidamente hasta temperatura ambiente y templar en agua un acero ordinario (de bajo carbono), se forma la estructura conocida como:
1. Perlita.
2. Esferoidita.
3. Bainita.
4. Ferrita.
5. Martensita.

Respuesta correcta: 5. Martensita.